Clinical trial inclusion criterion:
20-40 years old women

Entity relations:
- Has_value("old", "20-40 years")